No prior radiation therapy for at least 4 weeks before enrollment in the study

The above is a clinical trial inclusion criterion. Annotated with entity spans:
[Negation: No] [Temporal: prior] [Procedure: radiation therapy] for [Temporal: at least 4 weeks before enrollment] in the study